Liver disease such as cirrhosis or chronic active hepatitis.

The above is a clinical trial exclusion criterion. Annotated with entity spans:
[Condition: Liver disease] such as [Condition: cirrhosis] or [Condition: chronic active hepatitis].